Clinical trial exclusion criterion:
depression, antidepressant drugs treatment

Entity relations:
- AND("depression", "antidepressant drugs")